Clinical trial exclusion criterion:
Unable to walk (ex: wheelchair subjects)

Entity relations:
- Subsumes("Unable to walk", "wheelchair subjects")